Clinical trial inclusion criterion:
with any approved TAVI device

Annotated entities:
- Device: "TAVI device"